Autoimmune hepatitis

The above is a clinical trial exclusion criterion. Annotated with entity spans:
[Condition: Autoimmune hepatitis]